Clinical trial exclusion criterion:
Hypersensitivity or allergy to factor Xa inhibitors

Entity relations:
- AND("Hypersensitivity", "factor Xa inhibitors")
- OR("Hypersensitivity", "allergy")